下列有關膝關節手術（knee arthroplasty）術後之連續性被動關節運動（continuous passive movement）目的，何者最不正確？
A. 避免關節攣縮
B. 減少關節腫脹
C. 維持關節本體感
D. 增加股二頭肌之肌力

正確答案：D. 增加股二頭肌之肌力